Clinical trial exclusion criterion:
Decompensated heart failure

Entity relations:
- Has_qualifier("heart failure", "Decompensated")